Captopril 因為抑制converting enzyme使下列何種物質的代謝受阻，而產生咳嗽或血管性水腫（angioedema）的副作用？
A. angiotensin II
B. adenosine
C. bradykinin
D. prostacyclin

正確答案：C. bradykinin